A herd immunity of what percentage of the population is required to prevent sporadic outbreaks?

A herd immunity of 95% of the population is required to prevent sporadic outbreaks.